下列對於肝臟血管瘤（hemangioma）之敘述，何者錯誤？
A. 是最常見的良性肝臟腫瘤
B. 肝功能和 tumor markers 通常是正常的
C. 要診斷一定要先作切片（percutaneous biopsy）
D. 女性發生率比男性高

正確答案：C. 要診斷一定要先作切片（percutaneous biopsy）